En la secreción biliar hay:
1. Carboxipeptidasa.
2. Tripsina.
3. Quimotripsina.
4. Lecitina.
5. Elatasa.

Respuesta correcta: 4. Lecitina.